De acuerdo con la Teoría de la Acción Planificada de Ajzen, ¿cuál sería el determinante directo de la conducta?
1. La intención.
2. La definición de la situación.
3. La definición del evento.
4. La actitud hacia la conducta.
5. El control conductual percibido.

Respuesta correcta: 1. La intención.